What is caused by heterozygous lamin B1 and lamin B2 variants?

Heterozygous lamin B1 and Lamin B2 variants cause primary microcephaly and define a novel laminopathy.